Which is the branch site consensus sequence in U12-dependent introns?

The branch site consensus sequence in U12-dependent introns is UUCCUUAAC.